Clinical trial exclusion criterion:
do not speak English

Entity relations:
- Has_negation("speak English", "not")